Clinical trial inclusion criterion:
Male or female >18 years of age at the time of screening

Entity relations:
- Has_value("age", ">18 years of age")
- Has_index("at the time of screening", "the time of screening")
- Has_temporal(">18 years of age", "at the time of screening")
- OR("Male", "female")